Una falta de interés por llevar a cabo relaciones o conductas sexuales en general es, más propiamente:
1. Aversión sexual.
2. Falta de deseo sexual o deseo sexual inhibido.
3. Impotencia o anorgasmia.
4. Trastorno de excitación.
5. Disfunción orgásmica.

Respuesta correcta: 2. Falta de deseo sexual o deseo sexual inhibido.